Treatment with stable doses of angiotensin-converting enzyme inhibitors, angiotensin II receptor blockers or anti-aldosterone agents in the last four weeks.

The above is a clinical trial inclusion criterion. Annotated with entity spans:
Treatment with [Multiplier: stable doses] of [Drug: angiotensin-converting enzyme inhibitors], [Drug: angiotensin II receptor blockers] or [Drug: anti-aldosterone agents] [Temporal: in the last four weeks].